The patients receiving vitamin supplements or who had clinical evidence for an acute illness, renal dysfunction, thyroid dysfunction, chronic inflammatory diseases, inborn errors of homocysteine, cobalamin or folate metabolism, or any other condition known to interfere with homocysteine metabolism will be excluded

The above is a clinical trial exclusion criterion. Annotated with entity spans:
The patients receiving [Drug: vitamin supplements] or who had [Condition: clinical evidence for an acute illness], [Condition: renal dysfunction], [Condition: thyroid dysfunction], [Condition: chronic inflammatory diseases], [Condition: inborn errors of homocysteine], cobalamin or folate metabolism, or any other [Condition: condition known to interfere with homocysteine metabolism] will be excluded